Known pregnancy and/or lactation, or intent to become pregnant during this study.

The above is a clinical trial exclusion criterion. Annotated with entity spans:
[Pregnancy_considerations: Known pregnancy and/or lactation, or intent to become pregnant during this study.]